下列關於強迫症（obsessive compulsive disorder）的敘述，何者正確？
A. 完成強迫行為後可完全消除焦慮
B. 只有少數個案是突然發生，多數個案是不知不覺發生的（insidious onset）
C. 最常見的強迫思考內容是擔心受到污染
D. 多數個案覺得自己的強迫行為是合理的

正確答案：C. 最常見的強迫思考內容是擔心受到污染